3) major depressive disorder (PHQ-9 > 10) and diagnosed using the Structured Clinical Interview for Depression (SCID) according to the Diagnostic and Statistical Manual of Mental Disorders, Fourth Edition (DSM-IV),

The above is a clinical trial inclusion criterion. Annotated with entity spans:
[Parsing_Error: 3)] [Condition: major depressive disorder] ([Measurement: PHQ-9] [Value: > 10]) and diagnosed using the [Procedure: Structured Clinical Interview for Depression (SCID) according to the Diagnostic and Statistical Manual of Mental Disorders, Fourth Edition (DSM-IV)],